一位12歲國中女生首次診斷患有不明原因脊椎側彎症（idiopathic scoliosis），脊椎X光片顯示其最大彎曲點在第一腰椎位置，柯卜氏角度（Cobb's angle）為15度，下列何種處置最為恰當？
A. 給予運動治療與姿勢矯正，並追蹤檢查
B. 給予Milwaukee背架矯正
C. 給予Knight -Taylor背架矯正
D. 脊椎矯正手術治療

正確答案：A. 給予運動治療與姿勢矯正，並追蹤檢查